Clinical trial exclusion criterion:
Severe NC confounding conditions (stroke, head injury, or developmental learning disability).

Entity relations:
- Subsumes("NC confounding conditions", "stroke")
- OR("stroke", "developmental learning disability", "head injury")